HER-2 belongs to what family of proteins?

HER-2 belongs to the human epidermal growth factor receptor family, which is a family of proteins that also includes EGF, EGF1, HER3, HER4, HER5, and HER6.